12歲的蔡小弟弟因為騎腳踏車受傷，傷及大動脈而大量出血，經救護車送來醫院的時候，血壓已經開始下 降。急診室的賴醫師打算先幫他大量輸血，穩定生命徵兆後，再進行後續相關手術。經打電話跟蔡小弟弟的父母親聯絡後，蔡小弟弟的父母親基於宗教理由，堅持不能幫蔡小弟弟輸血，只能使用代用血漿。賴醫師向其父母親解釋代用血漿並無法完全取代血液，蔡小弟弟的情況，如果沒有輸血，恐怕會有生命危險，但其父
 母親仍然堅持不能輸血。此時賴醫師應該如何處理？
A. 不幫蔡小弟弟輸血，因為賴醫師已經充分解釋輸血以及代用血漿的差異，其父母親仍然堅持使用代用血漿
B. 不幫蔡小弟弟輸血，因為蔡小弟弟未成年，而其父母親為其法定代理人，應該尊重蔡小弟弟父母的決定
C. 幫蔡小弟弟輸血，因為蔡小弟弟的血壓已經開始下降，為了搶救其生命，毋需與父母溝通
D. 幫蔡小弟弟輸血，因為蔡小弟弟父母親的決定，違反蔡小弟弟的最佳利益構成法定代理權之濫用，所以不應採納

正確答案：D. 幫蔡小弟弟輸血，因為蔡小弟弟父母親的決定，違反蔡小弟弟的最佳利益構成法定代理權之濫用，所以不應採納